Clinical trial exclusion criterion:
Severe intercurrent infection

Annotated entities:
- Condition: "infection"
- Temporal: "intercurrent"
- Qualifier: "Severe"